¿Cuál de los siguientes NO es un Parámetro Farmacocinético?:
1. La Vida Media de Eliminación Plasmática (T1/2)
2. La Concentración Máxima (Cmáx) Plasmática.
3. La Constante de Afinidad Fármaco- Receptor.
4. El Área Bajo la Curva de las Concentraciones Plasmáticas (ABC o AUC).

Respuesta correcta: 3. La Constante de Afinidad Fármaco- Receptor.